一位45歲男性清潔工，過去健康情形良好，無任何病史，因呼吸急促胸悶住院，chest X-ray發現兩側肺野有 零散的毛玻璃病灶（ground-glass opacities），病人主訴前兩週去廢棄工廠打掃並清除雜物，一週前開始咳嗽、發燒、胸悶現象，住院後經支氣管鏡肺泡灌洗術（bronchoalveolar lavage）檢查發現有lymphocytosis現象，此病人最有可能的診斷為：
A. allergic bronchopulmonary aspergillosis
B. eosinophilic pneumonia
C. tuberculosis
D. hypersensitivity pneumonitis

正確答案：D. hypersensitivity pneumonitis